Clinical trial exclusion criterion:
Chronic or acute hepatitis B infection

Annotated entities:
- Condition: "Chronic hepatitis B infection"
- Condition: "acute hepatitis B infection"